眼球欲往內下（nasal lower）方向看時，須靠下列何組眼外肌共同作用？
A. 內直肌（medial rectus muscle）和下直肌（inferior rectus muscle）
B. 內直肌（meeial rectus muscle）和下斜肌（inferior oblique muscle）
C. 內直肌（medial rectus muscle）和上斜肌（superior obique muscle）
D. 內直肌（medial rectus muscle）和上直肌（superior rectus muscle）

正確答案：C. 內直肌（medial rectus muscle）和上斜肌（superior obique muscle）